Post-hysterectomy.

The above is a clinical trial exclusion criterion. Annotated with entity spans:
[Temporal: Post]-[Procedure: hysterectomy].